Clinical trial exclusion criterion:
Clinical conditions representing a contraindication to intramuscular vaccination and blood draws.

Entity relations:
- AND("contraindication", "intramuscular vaccination")
- OR("intramuscular vaccination", "blood draws")